Clinical trial inclusion criterion:
4. Has WHO/NYHA-FC of II or III.

Entity relations:
- Has_value("WHO/NYHA-FC", "II")
- OR("II", "III")